Evidence or history of Cor Pulmonale

The above is a clinical trial exclusion criterion. Annotated with entity spans:
[Mood: Evidence] or [Temporal: history] of [Condition: Cor Pulmonale]